Clinical trial exclusion criterion:
The use of insulin within the 3 months prior to screening

Annotated entities:
- Drug: "insulin"
- Temporal: "within the 3 months prior to screening"
- Reference_point: "screening"